¿Para cuál de los siguientes trastornos ha sido utilizada con éxito la exposición con prevención de respuesta?:
1. La encopresis.
2. El síndrome de Tourette.
3. El TDAH con predominio de la hiperactividad/impulsiva.
4. El consumo de tabaco en la adolescencia.
5. La timidez en la infancia.

Respuesta correcta: 2. El síndrome de Tourette.